¿Cuál de los compuestos siguientes es un regulador alostérico positivo de la gluconeogénesis?:
1. AMP.
2. Acetil-CoA.
3. Biotina.
4. Fructosa-2,6-bisfosfato.

Respuesta correcta: 2. Acetil-CoA.